Las proteínas globulares solubles se caracterizan por:
1. Presentar en su superficie aminoácidos aromáticos y alifáticos.
2. Presentar un núcleo interior apolar.
3. Estar parcialmente desplegadas dando lugar a estructuras poco compactas.
4. Presentar en su interior aminoácidos ácidos y básicos.
5. Un alto grado de hidratación en su interior.

Respuesta correcta: 2. Presentar un núcleo interior apolar.